下列何種藥物無法使攝護腺體積明顯縮小？
A. 雄性荷爾蒙受體拮抗劑（anti-androgenic receptor agent）
B. 甲型交感神經抑制劑（α-adrenergic blocker）
C. 5α還原酶抑制劑（5α-reductase inhibitor）
D. 女性荷爾蒙製劑

正確答案：B. 甲型交感神經抑制劑（α-adrenergic blocker）